Clinical trial inclusion criterion:
Follicles > 16 mm at the triggering day between 5-14

Entity relations:
- Has_value("Follicles > 16 mm", "between 5-14")
- Has_temporal("Follicles > 16 mm", "at the triggering day")